在正常情況下腎小管所分泌的氫離子，其大部分的最終途徑為何？
A. 以重吸收碳酸氫根（HCO3- ）的方式回收
B. 以銨離子（NH4+）的形式排出
C. 以游離氫離子的形式排出
D. 以可滴定酸（titratable acid）的形式排出

正確答案：A. 以重吸收碳酸氫根（HCO3- ）的方式回收